一名 30 歲男子因為最近幾個月來覺得陰囊處有下墜感就診。身體檢查發現右側睪丸較硬且為左側的三倍大。超音波檢查發現在右側睪丸有一個 5 公分大的實體腫瘤。實驗室檢查也顯示其血清中甲型胎兒蛋白（α-fetoprotein）值增加。下列病變中，何者最可能發生在他的右側睪丸？
A. 雷迪氏細胞瘤（Leydig cell tumor）
B. 精細胞瘤（seminoma）
C. 畸胎瘤（teratoma）
D. 卵黃囊瘤（yolk sac tumor）

正確答案：D. 卵黃囊瘤（yolk sac tumor）